history of an invasive malignancy (other than this prostate cancer,or basal or squamous skin cancers) within prior 5 years

The above is a clinical trial exclusion criterion. Annotated with entity spans:
history of an [Condition: invasive malignancy] ([Negation: other than] this [Condition: prostate cancer],or [Condition: basal] or [Condition: squamous skin cancers]) [Temporal: within prior 5 years]